Positive test at screening for anti-HIV, anti-HCV.

The above is a clinical trial exclusion criterion. Annotated with entity spans:
[Value: Positive] [Measurement: test] [Temporal: at screening] for anti-HIV, anti-HCV.